關於幻覺劑相關疾患（hallucinogen-related disorders）之敘述，下列何者錯誤？
A. 跟其他物質濫用疾患相較，幻覺劑較少出現合併症（comorbidity）及死亡（mortality）
B. 幻覺劑中毒的症狀包括知覺改變，如現實失真感、幻覺等；而身體上的症狀包括瞳孔變大、心跳加快、冒
C. 幻覺劑使用常見於年輕族群，其中又以女性較男性為多
D. D-麥角酸二乙胺（lysergic acid diethylamide, LSD）最主要是影響血清素系統

正確答案：C. 幻覺劑使用常見於年輕族群，其中又以女性較男性為多